病人發生缺氧狀態，例如呼吸衰竭或休克時，會改變葡萄糖的代謝，此時病人抽血檢查中，下列何者濃度會上升？
A. Acetyl-CoA
B. Ethanol
C. Lactate
D. Acetaldehyde

正確答案：C. Lactate